Recipient or donor is known to be seropositive for human immunodeficiency virus (HIV)

The above is a clinical trial exclusion criterion. Annotated with entity spans:
[Person: Recipient] or [Person: donor] is known to be [Value: seropositive] for [Measurement: human immunodeficiency virus] ([Measurement: HIV])